Clinical trial exclusion criterion:
Gastrointestinal disease,

Annotated entities:
- Condition: "Gastrointestinal disease"